下列有關分娩時之胎兒姿勢"transverse lie＂的敘述，何者錯誤？
A. 發生率低於 1%
B. 可因前置胎盤（placenta previa）引起
C. 子宮的異常是原因之一
D. 與羊水過多無關

正確答案：D. 與羊水過多無關